42歲男性，沒有糖尿病及慢性器官衰竭病史；15天前曾有2天腹瀉，緊接	雙腳腳底有麻刺感，逐漸轉為麻 木，沿	腳底一路麻到膝蓋，也發現兩側小腿的肌肉鬆垮及力量減弱，雙手使用筷子及扭瓶蓋的動作也變困
 難。下列有關病患的診斷臆測，何者最為正確？
A. 右側中大腦動脈的大面積中風
B. 遺傳性運動及感覺神經病變
C. 陳舊性的脊髓白質病變後遺症
D. 急性的周邊神經病變

正確答案：D. 急性的周邊神經病變